Clinical trial inclusion criterion:
Male and females aged 18 to 70 years

Entity relations:
- Has_value("aged", "18 to 70 years")
- OR("Male", "females")